Clinical trial exclusion criterion:
severe coronary artery disease, heart failure, kidney failure

Entity relations:
- Has_qualifier("coronary artery disease", "severe")
- OR("coronary artery disease", "heart failure", "kidney failure")